normotensive

The above is a clinical trial inclusion criterion. Annotated with entity spans:
[Condition: normotensive]